Clinical trial inclusion criteria:
Male and females aged 18 to 70 years
Brain death
Male and females aged 18 to 70 years
Indication of kidney transplantation
Informed consent

Annotated entities:
- Person: "Male"
- Person: "females"
- Person: "aged"
- Value: "18 to 70 years"
- Condition: "Brain death"
- Person: "Male"
- Person: "females"
- Person: "aged"
- Value: "18 to 70 years"
- Procedure: "kidney transplantation"
- Mood: "Indication"
- Informed_consent: "Informed consent"